Las balsas lipídicas (lipid rafts):
1. Ocupan grandes extensiones en las membranas.
2. Son estructuras rígidas que previenen la ruptura de las membranas.
3. Se proyectan hacia el exterior de las membranas.
4. Son estructuras muy dinámicas que se forman entre moléculas de colesterol y lípidos de membrana.

Respuesta correcta: 4. Son estructuras muy dinámicas que se forman entre moléculas de colesterol y lípidos de membrana.